Los linfocitos NKT:
1. Poseen receptores antigénicos de tipo KIR.
2. Reconocen lípidos unidos a moléculas CD1.
3. Poseen receptores antigénicos de T .
4. Producen IL-17 de forma destacada.

Respuesta correcta: 2. Reconocen lípidos unidos a moléculas CD1.